Clinical trial inclusion criterion:
Adult patients aged (>18), males and females, undergoing elective coronary artery bypass graft (CABG) surgery with cardiopulmonary bypass (CPB).

Entity relations:
- Has_value("aged", ">18")
- Subsumes("surgery coronary artery bypass graft", "CABG")
- Has_qualifier("surgery coronary artery bypass graft", "elective")
- Subsumes("cardiopulmonary bypass", "CPB")
- AND("surgery coronary artery bypass graft", "cardiopulmonary bypass")
- OR("males", "females")